Clinical trial exclusion criterion:
Has had a malignancy within 5 years before screening (exceptions are squamous and basal cell carcinomas of the skin and carcinoma in situ of cervix that has been surgically cured)

Annotated entities:
- Condition: "malignancy"
- Temporal: "within 5 years before screening"
- Reference_point: "screening"
- Condition: "squamous carcinomas of the skin"
- Condition: "basal cell carcinomas of the skin"
- Condition: "carcinoma in situ"
- Qualifier: "cervix"
- Qualifier: "surgically cured"
- Procedure: "surgically"
- Negation: "exceptions"